La media aritmética y no la mediana:
1. Es una medida de localización.
2. En su cálculo intervienen todos los valores de la muestra.
3. Es adimensional.
4. No está influenciada por los valores extremos.
5. Ninguna es correcta.

Respuesta correcta: 2. En su cálculo intervienen todos los valores de la muestra.